Dehydration

The above is a clinical trial inclusion criterion. Annotated with entity spans:
[Condition: Dehydration]